normal treadmill stress test

The above is a clinical trial inclusion criterion. Annotated with entity spans:
[Value: normal] [Measurement: treadmill stress test]